Clinical trial inclusion criterion:
Adult over 50 years of age.

Annotated entities:
- Person: "Adult"
- Value: "over 50 years"
- Person: "age"